下列何者並不支配味蕾細胞？
A. trigeminal nerve
B. facial nerve
C. glossopharyngeal nerve
D. vagus nerve

正確答案：A. trigeminal nerve